Clinical trial exclusion criterion:
Patients starting Adalimumab less than five half-lives after the interruption of a previous anti-TNF therapy.

Annotated entities:
- Drug: "Adalimumab"
- Temporal: "less than five half-lives after the interruption of a previous anti-TNF therapy"
- Reference_point: "the interruption of a previous anti-TNF therapy"
- Procedure: "anti-TNF therapy"
- Temporal: "previous"